HIV negative by 4th generation test (Ag/Ab test) or combination of enzymeimmunoassay (EIA) and HIV RNA

The above is a clinical trial inclusion criterion. Annotated with entity spans:
[Measurement: HIV] [Value: negative] by 4th generation test ([Measurement: Ag/Ab test]) or combination of [Measurement: enzymeimmunoassay] ([Measurement: EIA]) and [Measurement: HIV RNA]